What is marked by DNaseI hypersensitive sites?

Hypersensitive sites are chromosomal regions up to 2kb distant to known genomic regulatory regions and 5 kb from known regulatory regions.